關於電傷（electrical injury），下列敘述何者正確？
A. 電流通過體內時，因為血管的電阻最低，所以是電流傳導的主要組織，也因此血管承受最多傷害
B. 傳導大量電流的血管受傷後，可能造成血管栓塞（thrombosis）
C. 電傷若造成大範圍肌肉傷害，這些肌肉所釋放的肌球素（myoglobin）會引發阻塞性腎病變（obstructive nephropathy），治療這樣的傷患需要大量輸液，維持傷患的尿量在每公斤每小時1毫升（mL/kg/hr）左右
D. 低電壓（low-voltage）電傷的傷患，30%左右在受傷後數個月至數年間可能罹患白內障（cataract）或神經系統缺陷（neurologic deficits）

正確答案：B. 傳導大量電流的血管受傷後，可能造成血管栓塞（thrombosis）